Clinical trial exclusion criteria:
Allergy known to fish
Pregnant women who breast-feed or test positive for pregnancy

Annotated entities:
- Condition: "Allergy"
- Drug: "fish"
- Condition: "Pregnant"
- Person: "women"
- Condition: "breast-feed"
- Measurement: "test for pregnancy"
- Value: "positive"